Clinical trial inclusion criterion:
Substance Use Disorder is diagnosed according to DSM-5 criteria.

Annotated entities:
- Condition: "Substance Use Disorder"
- Qualifier: "DSM-5"